小內臟神經（lesser splanchnic nerve）源自於下列何者？
A. 第 1 及下頸神經節
B. 第 5－9 交感神經節
C. 第 10－11 交感神經節
D. 第 12 交感神經節

正確答案：C. 第 10－11 交感神經節